Please list the 3 findings in HELLP syndrome.

hemolysis, elevated liver enzymes and low platelets constitute the hellp syndrome.